Clinical trial exclusion criterion:
Receiving drugs acting primarily on the central nervous system, which lower the seizure threshold such as antipsychotic drugs (chlorpromazine, clozapine) or tricyclic antidepressants.

Entity relations:
- Has_qualifier("drugs acting primarily on the central nervous system", "lower the seizure threshold")
- Subsumes("antipsychotic drugs", "chlorpromazine")
- Subsumes("drugs acting primarily on the central nervous system", "chlorpromazine")
- OR("chlorpromazine", "clozapine")
- OR("antipsychotic drugs", "tricyclic antidepressants")